下列有關貯精囊（seminal vesicle），何者錯誤？
A. 俱內環外縱走向之平滑肌包被（smooth muscle coat）
B. 其分泌物中富含果糖（fructose）
C. 固有層中有許多彈性纖維（elastic fiber）
D. 內襯單層柱狀上皮細胞（simple columnar epithelium）

正確答案：D. 內襯單層柱狀上皮細胞（simple columnar epithelium）